造成氣管狹窄最常見的原因為：
A. 先天異常
B. 血管環
C. 腫瘤
D. 插管併發症

正確答案：D. 插管併發症